Clinical trial inclusion criteria:
Age 1 day to less than 18 years
Cared for in the pediatric intensive care unit or pediatric cardiac intensive care unit
receiving venovenous or venoarterial ECMO

Annotated entities:
- Person: "Age"
- Value: "1 day to less than 18 years"
- Visit: "pediatric intensive care unit"
- Visit: "pediatric cardiac intensive care unit"
- Procedure: "venoarterial ECMO"
- Procedure: "venovenous ECMO"